Clinical trial inclusion criteria:
Septic shock patients despite early goal directed therapy
Agree to participate this study

Annotated entities:
- Condition: "Septic shock"
- Procedure: "early goal directed therapy"
- Post-eligibility: "Agree to participate this study"